Clinical trial exclusion criterion:
Past participation in an HIV vaccine study

Annotated entities:
- Non-query-able: "Past participation in an HIV vaccine study"